Diagnosis of moderate erectile dysfunction (defined according to the NIH Consensus Development Panel on Impotence) for more than 6 months and demonstrating and incomplete response to tadalafil alone

The above is a clinical trial inclusion criterion. Annotated with entity spans:
Diagnosis of [Qualifier: moderate] [Condition: erectile dysfunction] (defined according to the NIH Consensus Development Panel on Impotence) [Temporal: for more than 6 months] and demonstrating and [Qualifier: incomplete] [Condition: response] to [Drug: tadalafil] alone